Known hypersensitivity to MTX

The above is a clinical trial exclusion criterion. Annotated with entity spans:
Known [Condition: hypersensitivity to MTX]